Insulin requiring diabetes

The above is a clinical trial exclusion criterion. Annotated with entity spans:
[Drug: Insulin] requiring [Procedure: diabetes]